Clinical trial exclusion criterion:
Hostility or refusal to cooperate

Entity relations:
- OR("Hostility", "refusal to cooperate")